Clinical trial exclusion criterion:
hemodynamically unstable heart failure

Annotated entities:
- Qualifier: "hemodynamically unstable"
- Condition: "heart failure"